Clinical trial inclusion criterion:
Primary or secondary amenorrhea for more than three months with LH and FSH> 30mUI/ml

Annotated entities:
- Condition: "amenorrhea"
- Qualifier: "secondary"
- Qualifier: "Primary"
- Temporal: "for more than three months"
- Measurement: "LH"
- Measurement: "FSH"
- Value: "> 30mUI/ml"